patients who do not wish to participate in the project;

The above is a clinical trial exclusion criterion. Annotated with entity spans:
[Post-eligibility: patients who do not wish to participate in the project];